關於下尿路的神經支配，下列敘述何者最為正確？
A. 交感神經主要為抑制膀胱收縮，關閉膀胱頸及關閉尿道，並不會經由下腹神經（hypogastric nerve）
B. 副交感神經主要讓逼尿肌收縮，產生排尿功能，主要經由下腹神經（hypogastric nerve）
C. 體神經主要支配外括約肌和其他骨盆底肌肉，主要經由陰部神經（pudendal nerve）
D. 感覺神經主要途經骨盆神經及陰部神經

正確答案：C. 體神經主要支配外括約肌和其他骨盆底肌肉，主要經由陰部神經（pudendal nerve）